一位 20 歲女性患者，因意識不清被送來急診處。在吸入室內空氣時，其動脈血液氣體分析顯示pH 7.14， 80 mmHg，PaO2 45 mmHg，HCO3- 28 mEq/L，BE:0 mEq/L。請問其低血氧症最可能之原因為何？
A. 中樞神經受抑制，換氣不足
B. 肺炎合併呼吸衰竭
C. 慢性阻塞性肺疾病之急性發作
D. 急性氣喘發作

正確答案：A. 中樞神經受抑制，換氣不足